Clinical trial exclusion criterion:
1. Unable to ambulate at least 150 feet prior to stroke, or experienced intermittent claudication while walking;

Entity relations:
- Has_index("prior", "stroke")
- Has_temporal("Unable to ambulate at least 150 feet", "prior")
- Has_qualifier("intermittent claudication", "while walking")
- OR("Unable to ambulate at least 150 feet", "intermittent claudication")